一胺基酸的側鍵為一環狀結構，但其生化性質與脂族側鍵（aliphatic side chain）相類似，由於此環狀結構的剛性，故難以摺疊進蛋白質的結構中，請問這個胺基酸的名稱為何？
A. 組織胺酸（Histidine）
B. 脯胺酸（Proline）
C. 酪胺酸（Tyrosine）
D. 色胺酸（Tryptophan）

正確答案：B. 脯胺酸（Proline）